Clinical trial exclusion criterion:
Subjects with less than one year duration of Parkinson's

Annotated entities:
- Multiplier: "less than one year duration"
- Condition: "Parkinson's"